Clinical trial inclusion criterion:
5. Self-rating anxiety scale (SAS) and self-rating depression scale (SDS) scores < 50

Entity relations:
- Subsumes("Self-rating anxiety scale", "SAS")
- AND("self-rating depression scale", "SDS")
- Has_value("Self-rating anxiety scale", "scores < 50")
- Has_value("self-rating depression scale", "scores < 50")